Clinical trial exclusion criterion:
irritable bowel syndrome

Annotated entities:
- Condition: "irritable bowel syndrome"